下列那一種致病菌能在上皮細胞（epithelial cells）內複製，並藉由形成肌動蛋白尾（actin tail）移動至緊鄰細胞內？
A. 白喉棒狀桿菌（Corynebacterium diphtheriae）
B. 單核球增生李斯特菌（Listeria monocytogenes）
C. 綠膿假單胞桿菌（Pseudomonas aeruginosa）
D. 肺炎克雷白氏菌（Klebsiella pneumoniae）

正確答案：B. 單核球增生李斯特菌（Listeria monocytogenes）